Clinical trial inclusion criterion:
RA cohort: Receiving MTX at stable doses of 10 to 25 mg weekly for at least 12 weeks, Have a DAS28 of 3.2 or higher (The level of disease activity is considered to be low if the DAS28 is 3.2 or less) (Prevoo et al., 1995)

Entity relations:
- Has_multiplier("MTX", "stable doses")
- Has_multiplier("MTX", "10 to 25 mg weekly")
- Has_temporal("MTX", "for at least 12 weeks")
- Has_value("DAS28", "3.2 or higher")
- AND("RA", "MTX")
- AND("RA", "DAS28")